El sistema de la fosfotransferasa (PTS) de muchas bacterias:
1. Es empleado comúnmente para incorporar azúcares del medio.
2. Participa en la fosforilación oxidativa.
3. Participa en la fosforilación a nivel de substrato.
4. Consume directamente ATP.
5. Desfosforila substratos como paso previo al transporte.

Respuesta correcta: 1. Es empleado comúnmente para incorporar azúcares del medio.